Clinical trial exclusion criterion:
Patients who were pregnant, nursing or not able to give written informed consent were excluded.

Annotated entities:
- Condition: "pregnant"
- Condition: "nursing"
- Observation: "able to give written informed consent"
- Negation: "not"